Serious suicidal tendency

The above is a clinical trial exclusion criterion. Annotated with entity spans:
Serious [Condition: suicidal tendency]